膽道出血（hemobilia）發生的原因，由過去的外傷性為主，慢慢轉變成醫源性（iatrogenic），下列敘述何者最不適當？
A. 以動脈出血為主要原因，而肝門靜脈出血則少見且容易自動止血
B. 手術治療是最佳止血方式，血管栓塞及保守治療只有輔助角色
C. 臨床症狀有典型三項：上腹痛、上消化道出血、黃疸
D. 影像診斷工具有內視鏡、電腦斷層、血管攝影等

正確答案：B. 手術治療是最佳止血方式，血管栓塞及保守治療只有輔助角色